一位 74 歲老先生，突然左側偏癱，立刻被送到急診室，發作 2 小時所作之腦部電腦斷層（沒打顯影劑）並沒有顯示病變，最可能之解釋是：
A. 腦部電腦斷層在缺血性腦中風（ischemic stroke）發作後 2 小時之內可能尚未顯示出病變
B. 出血性腦中風的出血量太少，電腦斷層顯示不出來
C. 電腦斷層影像品質不佳
D. 病人沒有中風

正確答案：A. 腦部電腦斷層在缺血性腦中風（ischemic stroke）發作後 2 小時之內可能尚未顯示出病變